active herpes outbreak

The above is a clinical trial exclusion criterion. Annotated with entity spans:
[Qualifier: active] [Condition: herpes] outbreak